intramural leiomyomas with an ultrasonographic size <20 cm but >4cm,

The above is a clinical trial inclusion criterion. Annotated with entity spans:
[Condition: intramural leiomyomas] with an [Measurement: ultrasonographic size] [Value: <20 cm but >4cm],